Clinical trial exclusion criterion:
Leg ulcers of greater than 1 year duration

Annotated entities:
- Condition: "Leg ulcers"
- Temporal: "greater than 1 year duration"